What effect does Methylsulfonylmethane (MSM) have on inflammation?

Methylsulfonylmethane (MSM) is an anti-inflammatory agent that acts by inhibiting inflammatory cytokine production and epithelial cell proliferation and differentiation.